ability to fill the Finnish versions of questionnaires.

The above is a clinical trial inclusion criterion. Annotated with entity spans:
[Non-query-able: ability to fill the Finnish versions of questionnaires.]